Clinical trial exclusion criterion:
Zollinger-Ellison syndrome or primary esophageal motility disorders

Entity relations:
- OR("Zollinger-Ellison syndrome", "primary esophageal motility disorders")